下列何者位於脊椎管腔（vertebral canal）內，且向上連至顱底的頂蓋膜（tectorial membrane）？
A. 髓核（nucleus pulposus）
B. 環狀纖維（annulus fibrosus）
C. 前縱韌帶（anterior longitudinal ligament）
D. 後縱韌帶（posterior longitudinal ligament）

正確答案：D. 後縱韌帶（posterior longitudinal ligament）